Clinical trial exclusion criterion:
Pregnant or breast feeding

Annotated entities:
- Condition: "Pregnant"
- Observation: "breast feeding"